En el tratamiento conductual del Trastorno Obsesivo Compulsivo, la técnica de la exposición con prevención de respuesta tiene como finalidad que el paciente:
1. Se habitúe a la ansiedad que le causan las obsesiones sin utilizar estrategias para neutralizarla o disminuirla.
2. Aprenda a suprimir de manera eficaz sus obsesiones.
3. Aprenda a retrasar la realización del ritual hasta que su ansiedad disminuya al menos hasta el 50% de la línea base inicial.
4. Aprenda a cuestionar los contenidos de sus obsesiones mediante técnicas de tipo cognitivo (p.ej., la flecha descendente, etc.).

Respuesta correcta: 1. Se habitúe a la ansiedad que le causan las obsesiones sin utilizar estrategias para neutralizarla o disminuirla.